有關全身性發炎反應症候群 SIRS（systemic inflammatory response syndrome）的定義，下列何者錯誤？
A. 心跳每分鐘大於90下
B. 收縮壓小於90 mmHg
C. 在正常呼吸下呼吸速率每分鐘大於20下或是血液中二氧化碳分壓（PaCO2）小於32 mmHg
D. 白血球大於12,000 cells/mm3或小於4000 cells/mm3或在周邊血液抹片有大於10% immature（Band）cells

正確答案：B. 收縮壓小於90 mmHg